Clinical trial inclusion criterion:
Previous diagnosis of type 2 diabetes, fulfilling at least one of the following criteria: 1) current treatment with oral antidiabetic drugs and/or insulin; 2) a fasting glucose value above 126 mg/dl on at least 2 occasions; 3) blood glucose level at 2 hours after an oral glucose tolerance test is equal to or more than 200 mg/dl; or 4) a glycated hemoglobin (HbA1c) level > 6.5 %

Entity relations:
- Has_temporal("oral antidiabetic drugs", "current")
- Has_value("fasting glucose", "above 126 mg/dl")
- Has_multiplier("fasting glucose", "on at least 2 occasions")
- multi("an oral glucose tolerance test", "oral glucose tolerance test")
- Has_index("at 2 hours after an oral glucose tolerance test", "an oral glucose tolerance test")
- Has_temporal("blood glucose level", "at 2 hours after an oral glucose tolerance test")
- Has_value("blood glucose level", "equal to or more than 200 mg/dl")
- Has_value("glycated hemoglobin (HbA1c) level", "> 6.5 %")
- Has_temporal("type 2 diabetes", "Previous")
- Has_multiplier("oral antidiabetic drugs", "at least one")
- AND("type 2 diabetes", "oral antidiabetic drugs")
- OR("oral antidiabetic drugs", "insulin")
- OR("oral antidiabetic drugs", "blood glucose level", "fasting glucose", "glycated hemoglobin (HbA1c) level")